Clinical trial exclusion criterion:
BMI > 30;

Entity relations:
- Has_value("BMI", "> 30")